Clinical trial inclusion criterion:
Patients undergoing tibial tubercle osteotomy (TTO) with or without medial patello-femoral ligament (MPFL) reconstruction

Entity relations:
- Has_temporal("tibial tubercle osteotomy (TTO)", "undergoing")
- AND("tibial tubercle osteotomy (TTO)", "medial patello-femoral ligament (MPFL) reconstruction")